下列各構造何者之組成軟骨與其它三者不同？
A. 會厭軟骨（epiglottis）
B. 氣管（trachea）
C. 甲狀軟骨（thyroid cartilage）
D. 環狀軟骨（cricoid cartilage）

正確答案：A. 會厭軟骨（epiglottis）